一位第一型糖尿病（type 1 diabetes mellitus）患者注射胰島素（insulin）後，未進食以至低血糖昏迷，下列 何者是造成低血糖的最主要因素？
A. 胰島素增加肝臟組織的第一型葡萄糖運輸蛋白（GLUT1）的作用
B. 胰島素增加肝外組織的第四型葡萄糖運輸蛋白（GLUT4）的作用
C. 胰島素增加肝臟hexokinase的活性
D. 胰島素增加肝外組織hexokinase的活性

正確答案：B. 胰島素增加肝外組織的第四型葡萄糖運輸蛋白（GLUT4）的作用